Clinical trial inclusion criterion:
Patients who have been monitored without complication such as acute rejection.

Annotated entities:
- Negation: "without"
- Condition: "complication"
- Condition: "acute rejection"